下列何者屬於外胜肽酶（exopeptidase）？
A. 胺基胜肽酶（aminopeptidase）
B. 胰凝乳蛋白酶（chymotrypsin）
C. 彈性酶（elastase）
D. 胰蛋白酶（trypsin）

正確答案：A. 胺基胜肽酶（aminopeptidase）